Clinical trial inclusion criterion:
estimated glomerular filtration rate (eGFR) > 60 ml/min

Entity relations:
- Has_value("estimated glomerular filtration rate (eGFR)", "> 60 ml/min")